2000公克早產兒在加護病房住院近兩個月，她因為雙側腎臟發育不全而合併慢性腎衰竭，又因為肺發育不全合併肺炎一直倚賴呼吸器治療，於3週前需開始⻑期腹膜透析以維持電解質及體液等平衡。很不幸地，這兩天醫師發現嬰兒發燒、透析液轉為混濁，並且流量大為減少，初步檢查診斷為黴菌性腹膜炎，除了用藥外，醫師建議手術更換腹膜透析管。這時候，不滿20歲的年輕父母親要求醫師：「她實在好可憐，不要救了，讓她走吧，請幫我們移除呼吸器，讓我們回家吧！」。下列何種做法最合適？
A. 父母生她，也是法定代理人，必須由父母移除其呼吸器
B. 取得父母同意書後，施予緩和醫療，可由醫護人員移除呼吸器，讓她回家
C. 以所有可用之現代醫療盡全力搶救到最後
D. 不移除維生之呼吸器，但停止手術等積極治療

正確答案：B. 取得父母同意書後，施予緩和醫療，可由醫護人員移除呼吸器，讓她回家